Systemically healthy adults.

The above is a clinical trial inclusion criterion. Annotated with entity spans:
[Qualifier: Systemically] [Condition: healthy] [Person: adults].